Parkinson disease diagnosed by United Kingdom Parkinson's disease Society Brain Bank Criteria

The above is a clinical trial inclusion criterion. Annotated with entity spans:
[Condition: Parkinson disease] diagnosed by [Measurement: United Kingdom Parkinson's disease Society Brain Bank Criteria]